Clinical trial exclusion criterion:
Inability to obtain informed consent from patient or next of kin

Annotated entities:
- Informed_consent: "Inability to obtain informed consent from patient or next of kin"